¿Cuál de las siguientes afirmaciones es cierta en relación a la vacunación y el embarazo?
1. El embarazo de la madre es una contraindicación para administrar la vacuna contra la varicela a su hijo.
2. Las vacunas inactivadas suponen un riesgo para el feto.
3. Están recomendadas las vacunas vivas atenuadas.
4. Ante una exposición de riesgo, la embarazada puede recibir inmunoglobulinas inespecíficas.

Respuesta correcta: 4. Ante una exposición de riesgo, la embarazada puede recibir inmunoglobulinas inespecíficas.